Clinical trial exclusion criteria:
eGFR <45
Type 2 diabetes (HbA1c>6.5) or type 1 diabetes
Any tobacco or nicotine product use in the past year
Low vitamin B12 Levels (< 300 pg/mL)
Self-reported severe difficulty or inability to walk 400m or climb 10 steps (from Q 2 and 19 on PAT-D)
Self-reported difficulty or inability to perform basic ADL functions (from Q 10, 13, 14, 16 on PAT-D)
Excessive alcohol use (>14 drinks/week)
Cancer requiring treatment in past year (except skin)
Dementia - diagnosed and/or MoCA score <18
Parkinson's or other neurological disease
Chronic liver disease or cirrhosis
End stage renal disease or on dialysis
Rheumatic conditions (Rheumatoid arthritis, lupus, and any other autoimmune disease the -PI deems them to be ineligible for)
Thyroid problems the PI deems them to be ineligible for
Gout
Involved in another interventional study
Hemoglobin <8 or diagnosed with anemia
Recent unintentional weight change (+/- 10 lbs. in the last 12 months)
BMI <18.5
Likely to not follow the protocol
PI deems unfit to participate
Already taking Metformin or any other drug intended to treat diabetes

Annotated entities:
- Measurement: "eGFR"
- Value: "<45"
- Condition: "Type 2 diabetes"
- Measurement: "HbA1c"
- Value: ">6.5"
- Condition: "type 1 diabetes"
- Observation: "nicotine product use"
- Observation: "tobacco"
- Temporal: "past year"
- Measurement: "vitamin B12 Levels"
- Value: "< 300 pg/mL"
- Non-query-able: "Self-reported severe difficulty or inability to walk 400m or climb 10 steps (from Q 2 and 19 on PAT-D)"
- Non-query-able: "Self-reported difficulty or inability to perform basic ADL functions (from Q 10, 13, 14, 16 on PAT-D)"
- Observation: "alcohol use"
- Multiplier: ">14 drinks/week"
- Condition: "Cancer"
- Procedure: "treatment"
- Temporal: "past year"
- Condition: "Dementia"
- Measurement: "MoCA score"
- Value: "<18"
- Condition: "Parkinson's"
- Condition: "neurological disease"
- Condition: "Chronic liver disease"
- Condition: "cirrhosis"
- Condition: "End stage renal disease"
- Procedure: "dialysis"
- Condition: "Rheumatic conditions"
- Condition: "Rheumatoid arthritis"
- Condition: "lupus"
- Condition: "autoimmune disease"
- Condition: "Thyroid problems"
- Condition: "Gout"
- Competing_trial: "Involved in another interventional study"
- Measurement: "Hemoglobin"
- Value: "<8"
- Condition: "anemia"
- Measurement: "weight"
- Value: "+/- 10 lbs."
- Temporal: "last 12 months"
- Measurement: "BMI"
- Value: "<18.5"
- Post-eligibility: "Likely to not follow the protocol"
- Non-query-able: "PI deems unfit to participate"
- Drug: "Metformin"
- Drug: "drug"
- Qualifier: "diabetes"